某產婦分娩時發生早期破水，且產程長達 30 小時，胎兒出生 1 週發現罹患腦膜炎，腦脊髓液檢體培養出觸酶（catalase）陰性之革蘭氏陽性球菌，在血液瓊脂平板上菌落呈現 β 溶血，且 CAMP 試驗為陽性。此新生兒最可能感染那一種病原菌？
A. 化膿性鏈球菌（Streptococcus pyogenes）
B. 金黃色葡萄球菌（Staphylococcus aureus）
C. 無乳鏈球菌（Streptococcus agalactiae）
D. 糞腸球菌（Enterococcus faecalis）

正確答案：C. 無乳鏈球菌（Streptococcus agalactiae）